The patient has no child bearing potential

The above is a clinical trial inclusion criterion. Annotated with entity spans:
The patient has [Negation: no] [Condition: child bearing potential]